Which R package has been developed for MS-based label-free phosphoproteomics?

Phosphonormalizer is an R package for normalization of MS-based label-free phosphoproteomics.